Prior transplant with stem cell infusion 90 days or active graft-versus-host treatment within 8 weeks of Day 1.

The above is a clinical trial exclusion criterion. Annotated with entity spans:
[Temporal: Prior] [Procedure: transplant] with [Procedure: stem cell infusion] [Temporal: 90 days] or [Temporal: active] [Procedure: graft-versus-host treatment] [Temporal: within 8 weeks of Day 1].